Clinical trial exclusion criterion:
The following concomitant medications are not allowed from 7 days prior to the first dose of study drug and during venetoclax administration: Strong CYP3A4 inhibitors including but not limited to fluconazole, ketoconazole, and clarithromycin or strong CYP3A4 inducers included but not limited to rifampin, carbamazepine.

Annotated entities:
- Temporal: "7 days prior"
- Reference_point: "first dose of study drug"
- Drug: "venetoclax"
- Procedure: "venetoclax administration"
- Drug: "Strong CYP3A4 inhibitors"
- Drug: "fluconazole"
- Drug: "ketoconazole"
- Drug: "clarithromycin"
- Drug: "strong CYP3A4 inducers"
- Drug: "rifampin"
- Drug: "carbamazepine"